Clinical trial exclusion criterion:
Urinary cotinine levels indicative of smoking or history or regular use of tobacco- or nicotine-containing products within 6 months prior to screening.

Annotated entities:
- Grammar_Error: "cotinine"
- Measurement: "Urinary cotinine levels"
- Condition: "smoking"
- Condition: "regular use of tobacco"
- Temporal: "history"
- Condition: "regular use of nicotine-containing products"
- Temporal: "within 6 months prior to screening"
- Reference_point: "screening"